Use of medications that interact with contraceptive steroid hormones: anti-epileptic medications, rifampin, rifabutin, fosamprenavir, etc

The above is a clinical trial exclusion criterion. Annotated with entity spans:
Use of [Drug: medications] that [Observation: interact with] [Drug: contraceptive steroid hormones]: [Drug: anti-epileptic medications], [Drug: rifampin], [Drug: rifabutin], [Drug: fosamprenavir], etc